Clinical trial inclusion criterion:
In good general health based on medical history and physical exam

Annotated entities:
- Condition: "good general health"
- Temporal: "medical history"
- Procedure: "physical exam"